一位 40 歲男性，因為發燒 4 日合併胸痛及呼吸困難而被送至急診，身體診查發現雙手手腕及手肘有多處扎針傷口，胸部 X 光有多處散發性病灶，尿液檢查呈現 heroin 陽性反應，血液檢查白血球數 14,900/μL，segment 88%，lymphocyte 10%，monocyte 2%，兩套血液培養在 48 小時後細菌室通報有革蘭氏陰性桿菌，此菌最有可能是：
A. Salmonella
B. Escherichia coli
C. Pseudomonas aeruginosa
D. HACEK organisms

正確答案：C. Pseudomonas aeruginosa